有關顱內動脈瘤（cerebral artery aneurysms）之敘述，下列何者錯誤？
A. 亦稱 berry or saccular aneurysms，通常位於血管分叉處，血管常見 media 缺損
B. 顱內動脈瘤可發生於 circle of Willis 任何位置，但較常見的是後循環（posterior circulation）
C. 顱內動脈瘤若發生於後循環，terminal bifurcation of the basilar artery 是最常發生處
D. 若病患於出血後沒立即死亡，rebleeding 是最可能造成死亡的原因，且好發於 initial hemorrhage 後 24 小時內

正確答案：B. 顱內動脈瘤可發生於 circle of Willis 任何位置，但較常見的是後循環（posterior circulation）